Clinical trial inclusion criterion:
Capable of understanding instructions and participating in the definition of a therapeutic goal (Boston Diagnostic Aphasia Examination (BDAE) < 3).

Annotated entities:
- Post-eligibility: "Capable of understanding instructions and participating in the definition of a therapeutic goal"
- Measurement: "Boston Diagnostic Aphasia Examination"
- Measurement: "BDAE"
- Value: "< 3"